Clinical trial exclusion criterion:
Pregnant woman or breastfeeding

Annotated entities:
- Condition: "Pregnant"
- Person: "woman"
- Observation: "breastfeeding"